¿Cuál de las siguientes alteraciones del lenguaje NO es característica de los niños con autismo?:
1. La inversión pronominal.
2. La ecolalia.
3. Las dificultades con el uso pragmático y social del lenguaje.
4. La dificultad persistente en la producción fonológica.

Respuesta correcta: 4. La dificultad persistente en la producción fonológica.